根據 The 7th Report of the Joint National Committee on Prevention, Detection, Evaluation and Treatment of  High Blood Pressure（The JNC 7 Report）的高血壓定義，有關 18 歲以上成人之血壓（blood pressure）的敘述，下列何者錯誤？
A. 正常血壓定義為＜120/80 mmHg
B. 高血壓前期（prehypertension）為 135-139/86-89 mmHg
C. 第一期高血壓（stage I hypertension）為 140-159/90-99 mmHg
D. 第二期高血壓（stage II hypertension）為 ≥ 160/100 mmHg

正確答案：B. 高血壓前期（prehypertension）為 135-139/86-89 mmHg